一位 15 個月的女童，出生週數為 32 週，出生體重 2100 公克。出生後只住院一週即可出院回家，住院期間無使用氧氣治療。她的發展進程是 9 個月會翻身，12 個月會坐穩，15 個月會扶著站。就目前她的情況，下列何者最不可能？
A. Cerebral palsy
B. Down syndrome
C. Neonatal spinal muscular atrophy
D. Hydrocephalus

正確答案：C. Neonatal spinal muscular atrophy